What is the localization of the protein encoded by the gene DNAJC11?

mitochondrial inner membrane